Coexisting neurological disease

The above is a clinical trial exclusion criterion. Annotated with entity spans:
Coexisting [Condition: neurological disease]